下列有關檢力（power）的敘述，何者正確？
A. 降低顯著水準，例如從 0.05 變成 0.01，檢力將變大
B. 如果對立假設的平均值，比預期更遠離虛無假設的平均值，則檢定的檢力將增加
C. 若觀測值的標準差增加，則檢力增加
D. 若樣本數減少，則檢力增加

正確答案：B. 如果對立假設的平均值，比預期更遠離虛無假設的平均值，則檢定的檢力將增加